Clinical trial exclusion criterion:
Absence of informed consent

Annotated entities:
- Informed_consent: "Absence of informed consent"